Clinical trial exclusion criterion:
Drivers and dangerous machine operators

Annotated entities:
- Person: "Drivers"
- Person: "dangerous machine operators"
- Grammar_Error: "and"